Radiotherapy within 14 days before enrollment (if the involved field is small, 7 days will be considered a sufficient interval between treatment and administration of the ixazomib.)

The above is a clinical trial exclusion criterion. Annotated with entity spans:
[Procedure: Radiotherapy] [Temporal: within 14 days before enrollment] (if the [Observation: involved field is small], [Temporal: 7 days] will be considered a sufficient interval between treatment and administration of the ixazomib.)